Clinical trial inclusion criterion:
Stable (8 wks or longer) concurrent medications including benzodiazepines, sedative hypnotics, antipsychotics, and antidepressants.

Annotated entities:
- Drug: "medications"
- Qualifier: "concurrent"
- Qualifier: "Stable"
- Temporal: "8 wks or longer"
- Drug: "benzodiazepines"
- Drug: "sedative hypnotics"
- Drug: "antipsychotics"
- Drug: "antidepressants"